下列何者不屬於心肺運動測試的絕對禁忌？
A. 第一度之心房心室傳導阻斷
B. 兩天內曾發生心肌梗塞
C. 不穩定型心絞痛
D. 無法控制的高血壓

正確答案：A. 第一度之心房心室傳導阻斷